下列何者不是休克治療失敗（refractory shock 或 irreversible shock）的可能原因？
A. 大腦嚴重缺血（severe cerebral ischemia）
B. 血液容積持續不足（persistent reduction of blood volume）
C. 心肌受到抑制而衰竭（myocardial depression / failure）
D. 急性呼吸窘迫症候群（acute respiratory distress syndrome, ARDS）

正確答案：B. 血液容積持續不足（persistent reduction of blood volume）